Clinically diagnosed autoimmune encephalitis

The above is a clinical trial inclusion criterion. Annotated with entity spans:
[Qualifier: Clinically diagnosed] [Condition: autoimmune encephalitis]